Clinical trial exclusion criterion:
Known hypersensitivity to chloroprocaine (a.k.a. Ester allergy), paraaminobenzoic acid (PABA) or bupivacaine (a.k.a. Amide allergy)

Annotated entities:
- Condition: "hypersensitivity"
- Drug: "chloroprocaine"
- Condition: "Ester allergy"
- Drug: "paraaminobenzoic acid"
- Drug: "PABA"
- Drug: "bupivacaine"
- Condition: "Amide allergy"